Clinical trial exclusion criterion:
HBA1c more than 108 mmol/l

Annotated entities:
- Measurement: "HBA1c"
- Value: "more than 108 mmol/l"